patients under legal custody,

The above is a clinical trial exclusion criterion. Annotated with entity spans:
patients under [Person: legal custody],